Clinical trial inclusion criterion:
Kyrgyz ethnicity

Annotated entities:
- Person: "Kyrgyz ethnicity"